Clinical trial exclusion criterion:
Cannot stand general anesthesia

Entity relations:
- AND("Cannot stand", "general anesthesia")